Localized intermediate-risk or high-risk prostate cancer cT3

The above is a clinical trial inclusion criterion. Annotated with entity spans:
Localized [Qualifier: intermediate-risk] or [Qualifier: high-risk] [Condition: prostate cancer] [Qualifier: cT3]